血中腎上腺素（epineprine）濃度上升時會抑制肝臟或肌肉的何種代謝作用？
A. 肝臟的糖解作用（glycolysis）
B. 肌肉的糖解作用
C. 肝臟的葡萄糖新生作用（gluconeogenesis）
D. 肌肉的肝糖分解作用（glycogenolysis）

正確答案：A. 肝臟的糖解作用（glycolysis）